Which is the human selenoprotein that contains several Se-Cys residues?

Selenoprotein P, that contains 10 selenocysteines.